Clinical trial exclusion criterion:
Pacing threshold(s) (at 0.4 or 0.5 ms) and/or sensing amplitude(s) and/or impedance(s) are not measurable

Entity relations:
- Has_qualifier("Pacing threshold", "at 0.4 or 0.5 ms")
- AND("Pacing threshold", "not measurable")
- OR("Pacing threshold", "impedance", "sensing amplitude")